Existence of a contraceptive method for women of reproductive age

The above is a clinical trial inclusion criterion. Annotated with entity spans:
Existence of a [Device: contraceptive] method for [Person: women] of [Value: reproductive] [Person: age]